下列關於隱胞子蟲（Cryptosporidium parvum）的敘述，何者錯誤？
A. 寄生於小腸上皮細胞
B. 曾經因自來水之水源遭污染而造成大流行
C. 患者新鮮糞便中的卵囊（oocyst）不具傳染性
D. 通常為自癒性（self-limiting）疾病，但在愛滋病患者可能造成慢性腹瀉

正確答案：C. 患者新鮮糞便中的卵囊（oocyst）不具傳染性